Clinical trial inclusion criteria:
18-80 years old;
Diagnosis of posterior circulation ischemic stroke;
Time from onset to treatment =6 hours;
NIHSS: 4-25;
Signed informed consent by patient self or legally authorized representatives.

Annotated entities:
- Person: "old"
- Value: "18-80 years old"
- Condition: "posterior circulation ischemic stroke"
- Observation: "Time from onset to treatment"
- Value: "=6 hours"
- Measurement: "NIHSS"
- Value: "4-25"
- Informed_consent: "Signed informed consent by patient self or legally authorized representatives."